Clinical trial exclusion criterion:
pregnant or lactating women

Annotated entities:
- Condition: "pregnant"
- Condition: "lactating"
- Person: "women"